Clinical trial exclusion criterion:
previous history of respiratory disease other than COPD

Annotated entities:
- Temporal: "previous history"
- Condition: "respiratory disease"
- Negation: "other than"
- Condition: "COPD"